metabolically unstable

The above is a clinical trial exclusion criterion. Annotated with entity spans:
[Condition: metabolically unstable]